Clinical trial exclusion criterion:
Serious or unstable cardiac, renal, neurologic, cerebrovascular, metabolic, or pulmonary disease

Entity relations:
- Has_qualifier("cardiac disease", "unstable")
- AND("unstable", "Serious")
- OR("cardiac disease", "metabolic disease", "cerebrovascular disease", "neurologic disease", "renal disease", "pulmonary disease")